Clinical trial inclusion criterion:
Patient has a history of bleeding diathesis or coagulopathy or will refuse blood transfusions

Entity relations:
- Has_mood("blood transfusions", "will refuse")
- OR("bleeding diathesis", "blood transfusions", "coagulopathy")